¿Cuál es la etapa común a todos los métodos de redisolución voltamperométrica?:
1. La preconcentración por adsorción física de los analitos sobre la superficie del electrodo.
2. La formación de amalgamas.
3. La resisolución por barrido de potencial.
4. La aplicación de un potencial adecuado en la etapa de preconcentración.

Respuesta correcta: 3. La resisolución por barrido de potencial.